Clinical trial exclusion criterion:
Use of depo medroxyprogesterone within 6 months of screening

Entity relations:
- Has_temporal("depo medroxyprogesterone", "within 6 months of screening")